下列何類抗癌藥物之作用在於影響細胞週期，且同時使用於 MOPP 及 ABVD 的抗癌治療處方劑？
A. Antibiotics
B. Antimetabolites
C. Alkylating agents
D. Plant alkaloids

正確答案：D. Plant alkaloids